Serum bilirubin less than or equal to 1.5 x institutional upper limit of normal (ULN)

The above is a clinical trial inclusion criterion. Annotated with entity spans:
[Measurement: Serum bilirubin] [Value: less than] or [Value: equal to 1.5 x institutional upper limit of normal (ULN)]